History of previous musculoskeletal injury of the same knee for excluding patients with secondary knee osteoarthritis

The above is a clinical trial exclusion criterion. Annotated with entity spans:
History of previous [Condition: musculoskeletal injury] of the same [Qualifier: knee] for excluding patients with [Condition: secondary knee osteoarthritis]